下列關於類固醇激素受體（steroid hormone receptor）作用的敘述，何者錯誤？
A. 熱休克蛋白（heat shock protein）會與受體之類固醇結合區結合，抑制受體活性
B. 類固醇激素受體不屬於細胞膜上的受體
C. 與類固醇配體（steroidal ligand）結合後構型改變，與熱休克蛋白解離後活化
D. 受體活化後會與DNA上hormone response elements（HREs）結合，幫助基因表現

正確答案：A. 熱休克蛋白（heat shock protein）會與受體之類固醇結合區結合，抑制受體活性